Clinical trial exclusion criterion:
Refusal of participant [or parent/guardian]

Annotated entities:
- Informed_consent: "Refusal of participant [or parent/guardian]"